DPP4 inhibitors or Sodium-glucose cotransporter-2(SGLT2) inhibitors within the previous 4 weeks

The above is a clinical trial exclusion criterion. Annotated with entity spans:
[Drug: DPP4 inhibitors] or [Drug: Sodium-glucose cotransporter-2(SGLT2) inhibitors] [Temporal: within the previous 4 weeks]